Clinical trial exclusion criterion:
Known or suspected contraindications to the study medications, including history of allergy to Angiotensin converting enzyme (ACE) inhibitors and/or to thiazide diuretics or other sulfonamide derived drug

Annotated entities:
- Condition: "allergy"
- Drug: "Angiotensin converting enzyme (ACE) inhibitors"
- Drug: "thiazide diuretics"
- Drug: "sulfonamide derived drug"
- Condition: "contraindications"
- Drug: "study medications"
- Temporal: "history of"
- Qualifier: "other"